Which deep learning framework has been developed for cancer molecular subtype classification?

DeepCC is a novel deep learning-based framework for cancer molecular subtype classification. DeepCC is platform independent, robust to missing data, and can be used for single sample prediction.